Clinical trial inclusion criterion:
Hyperglycemic (Glucose level > 126 mg/dL)

Annotated entities:
- Condition: "Hyperglycemic"
- Measurement: "Glucose level"
- Value: "> 126 mg/dL"